王先生 45 歲，患有高血壓、糖尿病，因急性左心室前壁心肌梗塞住院 10 天，住院中偶有心絞痛發作情形。若王先生沒有任何禁忌症，以實證醫學角度觀之，出院的用藥中，下列何項是最不必要的？
A. aspirin
B. alpha-blocker
C. beta-blocker
D. angiotensin-converting enzyme inhibitor

正確答案：B. alpha-blocker